planned to DAPT for 1 year after PCI

The above is a clinical trial inclusion criterion. Annotated with entity spans:
[Mood: planned to] [Procedure: DAPT] [Multiplier: for 1 year] [Temporal: after PCI]